Clinical trial inclusion criterion:
American Society of Anesthesiologist physical status 1-3

Entity relations:
- Has_value("American Society of Anesthesiologist physical status", "1-3")